Clinical trial exclusion criterion:
Pregnant or nursing (lactating) women

Entity relations:
- Subsumes("nursing", "lactating")
- OR("Pregnant", "nursing")